Clinical trial inclusion criterion:
Measurable metastatic disease

Annotated entities:
- Condition: "metastatic disease"
- Qualifier: "Measurable"